Currently taking 1 to 3 antiepileptic drugs.

The above is a clinical trial inclusion criterion. Annotated with entity spans:
Currently taking [Multiplier: 1 to 3] [Drug: antiepileptic drugs].